Clinical trial exclusion criterion:
Life expectancy of less than 3 years, due to intercurrent disease, especially neoplastic,

Entity relations:
- AND("intercurrent disease", "Life expectancy")
- AND("neoplastic", "Life expectancy")
- OR("Life expectancy", "less than 3 years")